衛生福利部食品藥物管理署推廣的「天天 5 蔬果，健康又樂活」是屬於公共衛生預防原則的那一段那一級預防？
A. 初段一級
B. 初段二級
C. 次段三級
D. 三段四級

正確答案：A. 初段一級